Clinical trial inclusion criterion:
toxicity or intolerance if receiving a boosted-protease inhibitor regimen at screening (with plasma HIV RNA < 400 copies/mL at screening)

Entity relations:
- AND("boosted-protease inhibitor regimen", "protease inhibitor")
- Has_value("plasma HIV RNA", "< 400 copies/mL")
- Has_temporal("plasma HIV RNA", "at screening")
- Has_temporal("boosted-protease inhibitor regimen", "at screening")
- AND("boosted-protease inhibitor regimen", "toxicity")
- OR("toxicity", "intolerance")